Clinical trial inclusion criterion:
Currently taking an antidepressant, mood stabiliser, antipsychotic, anticonvulsant, warfarin or thyroxin, or current regular use (more than 2 days per week) of a benzodiazepine or opioid-based analgesic

Entity relations:
- Has_temporal("taking", "Currently")
- Subsumes("regular", "more than 2 days per week")
- AND("taking", "antidepressant")
- Has_multiplier("use", "regular")
- Has_temporal("use", "current")
- AND("use", "benzodiazepine")
- OR("benzodiazepine", "opioid-based analgesic")
- OR("antidepressant", "warfarin", "anticonvulsant", "antipsychotic", "mood stabiliser", "thyroxin")
- OR("taking", "use")